less than 18 years of age of more than 80 years of age

The above is a clinical trial exclusion criterion. Annotated with entity spans:
[Value: less than 18 years] of [Person: age] of [Value: more than 80 years] of [Person: age]